Clinical trial exclusion criterion:
Severe cardiovascular disorder, renal failure, peritonitis, sepsis

Annotated entities:
- Condition: "cardiovascular disorder"
- Qualifier: "Severe"
- Condition: "renal failure"
- Condition: "peritonitis"
- Condition: "sepsis"